Clinical trial exclusion criterion:
2. Are pregnant or lactating

Entity relations:
- OR("pregnant", "lactating")